Patients with allergic contact dermatitis to para-phenylenediamine (PPD) based on a history of PPD contact dermatitis and positive PPD patch tests.

The above is a clinical trial inclusion criterion. Annotated with entity spans:
Patients with [Condition: allergic contact dermatitis] to [Drug: para-phenylenediamine (PPD)] based on a history of [Drug: PPD] [Condition: contact dermatitis] and [Value: positive] [Measurement: PPD patch tests].